Clinical trial inclusion criterion:
Group 2: Healthy subjects without known psoriatic disease or cardiovascular disease

Annotated entities:
- Condition: "Healthy"
- Condition: "psoriatic disease"
- Condition: "cardiovascular disease"
- Negation: "without"